• Good response to nonsteroidal anti-inflammatory drugs (NSAID)

The above is a clinical trial inclusion criterion. Annotated with entity spans:
• [Observation: Good response] to [Drug: nonsteroidal anti-inflammatory drugs (NSAID)]